下列何者不屬於血液- 氣體障壁（blood-air barrier）的一部分？
A. I 型肺泡細胞（Type I alveolar cell）
B. 間隔細胞（Septal cell）
C. 內皮細胞（Endothelial cell）
D. 微血管的基板（Basal lamina）

正確答案：B. 間隔細胞（Septal cell）